Clinical trial inclusion criterion:
Reduced HDL-cholesterol (<40mg/dl in men, <50 mg/dl in women), or on medication for treating the condition

Entity relations:
- Has_value("HDL-cholesterol", "Reduced")
- Has_value("women", "<50 mg/dl")
- Has_value("men", "<40mg/dl")
- AND("Reduced", "men")
- Has_qualifier("medication for treating", "HDL-cholesterol")
- OR("men", "women")